Clinical trial inclusion criterion:
Age: 18 to75 years old;

Annotated entities:
- Person: "Age"
- Value: "18 to75 years old"